Any therapeutic invasive cardiac procedure resulting in a permanent implant that is performed within 30 days of the index procedure. Examples of permanent implant would include any new heart valve. Implantation of a permanent pacemaker is excluded.

The above is a clinical trial exclusion criterion. Annotated with entity spans:
Any [Qualifier: therapeutic] [Qualifier: invasive] [Procedure: cardiac procedure] resulting in a [Device: permanent implant] that is performed [Temporal: within 30 days of the index procedure]. Examples of permanent implant would include any new [Device: heart valve]. Implantation of a [Device: permanent pacemaker] is [Negation: excluded].